HBV DNA < 6 log IU/ml (LLOD)

The above is a clinical trial inclusion criterion. Annotated with entity spans:
[Measurement: HBV DNA] [Value: < 6 log IU/ml] ([Qualifier: LLOD])